下列何者不參與十字吻合（cruciate anastomosis）的形成？
A. 第一穿通動脈（the first perforating artery）
B. 臀上動脈（superior gluteal artery）
C. 股內側迴旋動脈（medial femoral circumflex artery）
D. 股外側迴旋動脈（lateral femoral circumflex artery）

正確答案：B. 臀上動脈（superior gluteal artery）